En relación con el paludismo, los esquizontes preeritrocíticos pueden hallarse en:
1. Reticulocitos.
2. Células hepáticas.
3. Células renales.
4. Linfocitos.
5. Eosinófilos.

Respuesta correcta: 2. Células hepáticas.